Clinical trial inclusion criterion:
A person who is or is a beneficiary of social security

Annotated entities:
- Non-query-able: "A person who is or is a beneficiary of social security"